Clinical trial exclusion criterion:
Serum potassium >5.4 mmol/L.

Entity relations:
- Has_value("Serum potassium", ">5.4 mmol/L")